Clinical trial inclusion criterion:
American Society of Anesthesiologists (ASA) I e II;

Annotated entities:
- Measurement: "American Society of Anesthesiologists (ASA)"
- Value: "I e II"